Clinical trial exclusion criterion:
On chronic treatment (i.e., two weeks or more) with any medication severely affecting oral status (e.g. participants with gingival hypertrophy caused by anti-epileptics, calcium antagonists, cyclosporine and other immunosuppressive) or bone metabolism (e.g. anticoagulant medications, long-standing steroid medications -i.e. equal or more 2.5mg of prednisolone a day taken for >3 months -, anticonvulsants, immunosuppressants).

Entity relations:
- Has_temporal("treatment", "two weeks or more")
- AND("gingival hypertrophy", "anti-epileptics")
- Has_multiplier("prednisolone", "equal or more 2.5mg a day")
- Has_temporal("prednisolone", ">3 months")
- Subsumes("bone metabolism", "anticoagulant")
- OR("anti-epileptics", "calcium antagonists", "cyclosporine", "immunosuppressive")
- OR("gingival hypertrophy", "bone metabolism")
- OR("anticoagulant", "steroid", "prednisolone", "anticonvulsants", "immunosuppressants")